糖尿病患者最不會併發那種眼疾？
A. 白內障
B. 視網膜病變
C. 動眼神經麻痺
D. 凸眼症

正確答案：D. 凸眼症